Clinical trial exclusion criterion:
Current drug and alcohol abuse.

Annotated entities:
- Condition: "alcohol abuse"
- Condition: "drug abuse"